angioneurotic edema in medical history (hereditary / idiopathic or associated with prior treatment with ACE inhibitors)

The above is a clinical trial exclusion criterion. Annotated with entity spans:
[Condition: angioneurotic edema] in medical history ([Qualifier: hereditary] / [Qualifier: idiopathic] or [Qualifier: associated] with [Temporal: prior] [Procedure: treatment] with [Drug: ACE inhibitors])